Clinical trial inclusion criterion:
Women subjected to ICSI through controlled ovarian hyperstimulation (COH) with pituitary downregulation by GnRH antagonist.

Annotated entities:
- Person: "Women"
- Procedure: "ICSI"
- Procedure: "ovarian hyperstimulation"
- Procedure: "COH"
- Procedure: "pituitary downregulation"
- Procedure: "GnRH antagonist"